Clinical trial exclusion criterion:
Patients who had any complication during phacoemulsification surgery

Entity relations:
- Has_index("during phacoemulsification surgery", "phacoemulsification surgery")
- multi("phacoemulsification surgery", "phacoemulsification surgery")
- Has_temporal("complication", "during phacoemulsification surgery")
- Has_qualifier("complication", "any")